Clinical trial exclusion criteria:
Subjects under the age of 21.
Subjects with excessively thin corneas.
Subjects with topographic evidence of keratoconus.
Subjects with ectatic eye disorders.
Subjects with autoimmune diseases.
Subjects who are pregnant or nursing.

Annotated entities:
- Value: "under the age of 21"
- Person: "age"
- Condition: "excessively thin corneas"
- Condition: "topographic evidence"
- Condition: "keratoconus"
- Condition: "ectatic eye disorders"
- Condition: "autoimmune diseases"
- Condition: "pregnant"
- Condition: "nursing"